any prior adverse response to lisdexamfetamine dimesylate or other stimulant medication

The above is a clinical trial exclusion criterion. Annotated with entity spans:
any [Temporal: prior] [Condition: adverse response] to [Drug: lisdexamfetamine dimesylate] or [Qualifier: other] [Drug: stimulant medication]